Clinical trial exclusion criterion:
Immunocompromised subject

Annotated entities:
- Condition: "Immunocompromised"